Clinical trial exclusion criterion:
failure to gain consent of parents.

Annotated entities:
- Observation: "consent of parents"
- Negation: "failure to gain"
- Informed_consent: "failure to gain consent of parents"